Participation in another clinical trial within the past 30 days.

The above is a clinical trial exclusion criterion. Annotated with entity spans:
[Non-query-able: Participation in another clinical trial within the past 30 days.]